Clinical trial exclusion criterion:
Haematological disorders (Anaemia, malignancy, bleeding disorders)

Entity relations:
- Subsumes("Haematological disorders", "Anaemia")
- OR("Anaemia", "malignancy", "bleeding disorders")